針對侵犯性膀胱癌最有效之單一化學藥物為：
A. Methotrexate
B. Vinblastine
C. Doxorubicin
D. Cisplatin

正確答案：D. Cisplatin